durg-naive or drug-free

The above is a clinical trial inclusion criterion. Annotated with entity spans:
[Drug: durg]-[Negation: naive] or [Drug: drug]-[Negation: free]